Clinical trial exclusion criterion:
Severe dyspnea at rest because of complications of advanced malignancy or requiring current continuous oxygen therapy.

Annotated entities:
- Condition: "dyspnea"
- Qualifier: "Severe"
- Condition: "advanced malignancy"
- Procedure: "continuous oxygen therapy"
- Temporal: "current"
- Condition: "complications"
- Qualifier: "requiring current continuous oxygen therapy"